Clinical trial exclusion criterion:
has current oral lesions, canker sores, or piercings

Entity relations:
- Has_temporal("oral lesions", "current")
- OR("oral lesions", "canker sores", "piercings")